Treatment of solid malignancy or non-melanoma skin cancer within the past 5 years, or any history of melanoma or hematologic or lymphoproliferative malignancy

The above is a clinical trial exclusion criterion. Annotated with entity spans:
Treatment of [Condition: solid malignancy] or [Condition: non-melanoma skin cancer] [Temporal: within the past 5 years], or any history of [Condition: melanoma] or [Condition: hematologic] or [Condition: lymphoproliferative malignancy]